History of malignancy including leukemia and lymphoma (but not basal cell skin carcinoma) within the past five years

The above is a clinical trial exclusion criterion. Annotated with entity spans:
History of [Condition: malignancy] including [Condition: leukemia] and [Condition: lymphoma] (but not [Condition: basal cell skin carcinoma]) [Temporal: within the past five years]